El principal factor de virulencia de Streptococcus pneumoniae es una (un):
1. Fímbria.
2. Cápsula.
3. Flagelo.
4. Endotoxina.
5. Adhesina.

Respuesta correcta: 2. Cápsula.